1. Justification: Using right-handed individuals will reduce variability in BOLD MRI data.

The above is a clinical trial inclusion criterion. Annotated with entity spans:
[Parsing_Error: 1.] [Not_a_criteria: Justification: Using right-handed individuals will reduce variability in BOLD MRI data.]